Clinical trial exclusion criterion:
Medical illness unrelated to the tumor which in the opinion of the attending physician and principal investigator will preclude administration of the agent. This includes patients with uncontrolled infection, chronic renal insufficiency, myocardial infarction within the past 6 months, unstable angina, cardiac arrhythmias other than chronic atrial fibrillation and chronic active or persistent hepatitis, or New York Heart Association Classification III or IV heart disease.

Annotated entities:
- Condition: "Medical illness unrelated to the tumor"
- Undefined_semantics: "Medical illness unrelated to the tumor"
- Subjective_judgement: "which in the opinion of the attending physician and principal investigator will preclude administration of the agent"
- Undefined_semantics: "which in the opinion of the attending physician and principal investigator will preclude administration of the agent"
- Post-eligibility: "which in the opinion of the attending physician and principal investigator will preclude administration of the agent"
- Condition: "uncontrolled infection"
- Undefined_semantics: "uncontrolled infection"
- Condition: "chronic renal insufficiency"
- Condition: "myocardial infarction"
- Temporal: "within the past 6 months"
- Condition: "unstable angina"
- Condition: "cardiac arrhythmias"
- Condition: "chronic atrial fibrillation"
- Negation: "other than"
- Condition: "persistent hepatitis"
- Measurement: "New York Heart Association"
- Value: "Classification III or IV"
- Condition: "heart disease"
- Undefined_semantics: "heart disease"
- Condition: "chronic active hepatitis"
- Grammar_Error: "and"